Severe Arrhythmia including atrial fibrillation, atrial flutter, ventricular fibrillation, ventricular flutter or ventricular tachycardia.

The above is a clinical trial exclusion criterion. Annotated with entity spans:
[Qualifier: Severe] [Condition: Arrhythmia] including [Condition: atrial fibrillation], [Condition: atrial flutter], [Condition: ventricular fibrillation], [Condition: ventricular flutter] or [Condition: ventricular tachycardia].